Clinical trial inclusion criteria:
Women who are in their first 5 years of menopause
Have a T score between -1 and -2.49 at the femoral neck, total hip, or L1-L4 spine
Be 19 years of age or older
Have their health care provider's permission to enroll in the study.

Annotated entities:
- Person: "Women"
- Temporal: "n their first 5 years of menopause"
- Reference_point: "menopause"
- Condition: "menopause"
- Measurement: "T score"
- Temporal: "between -1 and -2.49"
- Qualifier: "femoral neck"
- Qualifier: "total hip"
- Qualifier: "L1-L4 spine"
- Value: "19 years of age or older"
- Person: "age"
- Non-query-able: "Have their health care provider's permission to enroll in the study."